La capacidad de ser claro, honesto y comunicarse de forma directa cuando es necesario dar malas noticias, se denomina:
1. Empatía.
2. Asertividad.
3. Autoconfianza.
4. Simpatía.

Respuesta correcta: 2. Asertividad.